asthma requiring regular therapy

The above is a clinical trial exclusion criterion. Annotated with entity spans:
[Condition: asthma] requiring [Procedure: regular therapy]